Clinical trial exclusion criterion:
are on other studies requiring blood draws that might exceed 450 mL total during the period of the influenza vaccine study

Annotated entities:
- Competing_trial: "are on other studies requiring blood draws that might exceed 450 mL total during the period of the influenza vaccine study"